¿Cómo se denomina las contracciones musculares breves, repentinas, simples, semejantes a descargas o sacudidas que afectan a músculos o grupos musculares?
1. Movimientos hemibalísmicos.
2. Movimientos atetósicos.
3. Movimientos espasmódicos.
4. Movimientos mioclónicos.
5. Movimientos distónicos.

Respuesta correcta: 4. Movimientos mioclónicos.